Clinical trial exclusion criterion:
ALT(Alanine aminotransferase) level of liver function test exceeded 5 times of reference range

Annotated entities:
- Measurement: "ALT(Alanine aminotransferase) level"
- Procedure: "liver function test"
- Value: "exceeded 5 times of reference range"